一位 36 歲男性在登山路上，不小心被落石擊中上腹部靠近劍突地方，主訴胸部疼痛，被送到醫院來，檢查發現病人左邊呼吸聲降低，沒有肋骨骨折，左邊插胸管後首先流出血液，後來又有一些粒狀物流出來，病人仍感覺相當痛，下一步要安排何種檢查來確定診斷？
A. 胸部 X 光
B. 淋巴攝影
C. 血管攝影
D. 食道鏡或食道攝影

正確答案：D. 食道鏡或食道攝影